Clinical trial exclusion criterion:
Evidence of another diagnosis that can explain serous SRF or visual loss;

Annotated entities:
- Non-representable: "Evidence of another diagnosis that can explain serous SRF or visual loss;"